Has a body mass index >27 and <47 kg/m2.

The above is a clinical trial inclusion criterion. Annotated with entity spans:
Has a [Measurement: body mass index] [Value: >27 and <47 kg/m2].